流產（Abortion）的定義是指在臨床懷孕幾週之前終止懷孕？（從最後一次月經的第一天算起）
A. 懷孕 8 週之前
B. 懷孕 12 週之前
C. 懷孕 16 週之前
D. 懷孕 20 週之前

正確答案：D. 懷孕 20 週之前